Clinical trial exclusion criterion:
Patient unable to receive either propofol or isoflurane due to allergy or other specific contraindication.

Annotated entities:
- Drug: "propofol"
- Drug: "isoflurane"
- Condition: "allergy"
- Condition: "unable to receive"